40歲男性，感染人類免疫不全病毒（HIV），有憂鬱症病史，曾經有自殺意圖，CD4+ T細胞數50 cells/µL， HIV病毒量10,000 copies/mL，下列抗反轉錄病毒藥物，何者最不適合這位病人長期治療？
A. raltegravir
B. rilpivirine
C. dolutegravir
D. efavirenz

正確答案：D. efavirenz